immunosuppression including AIDS, corticosteroids over 60mg/day

The above is a clinical trial exclusion criterion. Annotated with entity spans:
[Condition: immunosuppression] including [Condition: AIDS], [Drug: corticosteroids] [Multiplier: over 60mg/day]